Clinical trial exclusion criterion:
Planned removal of more than 10 lung lesions

Entity relations:
- Has_multiplier("lung lesions", "more than 10")